Clinical trial exclusion criterion:
Pre-existing hemoptysis of a severity > grade 3 by NCI CTCAE criteria within 4 weeks prior to study entry

Annotated entities:
- Condition: "hemoptysis"
- Qualifier: "severity"
- Value: "> grade 3"
- Measurement: "NCI CTCAE criteria"
- Temporal: "within 4 weeks prior to study entry"
- Reference_point: "study entry"